在固定條件下，下列吸入性麻醉劑，何者能使肺泡濃度與吸入濃度比值（FA/ FI）上升速度最快？
A. isoflurane
B. desflurane
C. halothane
D. sevoflurane

正確答案：B. desflurane